Clinical trial inclusion criterion:
American Society of Anesthesiologists risk classification I and II

Entity relations:
- Has_value("American Society of Anesthesiologists risk classification", "I and II")